What is herd immunity?

Vaccines are very effective in providing individual and community (herd) immunity against a range of diseases.
We argue that individuals who have access to vaccines and for whom vaccination is not medically contraindicated have a moral obligation to contribute to the realisation of herd immunity by being vaccinated.